What is the function of the ISW1 and CHD1 remodellers in yeast chromatin?

Chd1 and chd1 atp-dependent chromatin remodelers compete to set nucleosome spacing in vivo.